concomitant treatments with medication known to have drug interactions with dronabinol, such as, central nervous system depressants (barbiturates, benzodiazepines, buspirone, lithium, etc) and anticholinergic agents (atropine, scopolamine, antihistamines, etc).

The above is a clinical trial exclusion criterion. Annotated with entity spans:
concomitant [Procedure: treatments] with [Drug: medication] known to have [Condition: drug interactions] with [Drug: dronabinol], such as, [Drug: central nervous system depressants] ([Drug: barbiturates], [Drug: benzodiazepines], [Drug: buspirone], [Drug: lithium], etc) and [Drug: anticholinergic agents] ([Drug: atropine], [Drug: scopolamine], [Drug: antihistamines], etc).